Fusarium oxysporum f. sp lycopersici. is a plant pathogen in plants producing what common food?

Fusarium wilt caused by Fusarium oxysporum f. sp lycopersici (Fol) is one of the main diseases affecting tomatoes.